粒線體電子傳遞鏈的 Complex III 主要是把電子傳遞到：
A. Cytochrome c
B. Succinate
C. NADH
D. Ubiquinone

正確答案：A. Cytochrome c